Clinical trial exclusion criterion:
Has received prior immunotherapy with an anti-Programmed Cell Death Receptor 1 (PD-1), Programmed Cell Death Receptor Ligand 1 (anti-PD-L1), or anti- Programmed Cell Death Receptor Ligand 2 (PD-L2) or has previously participated in clinical studies with pembrolizumab

Entity relations:
- AND("immunotherapy", "anti-Programmed Cell Death Receptor 1 (PD-1)")
- OR("anti-Programmed Cell Death Receptor 1 (PD-1)", "Programmed Cell Death Receptor Ligand 1 (anti-PD-L1)", "anti- Programmed Cell Death Receptor Ligand 2 (PD-L2)")
- OR("immunotherapy", "participated in clinical studies with pembrolizumab")